Clinical trial inclusion criterion:
A consent form signed by the patient or patient's representative

Annotated entities:
- Post-eligibility: "A consent form signed by the patient or patient's representative"